有關兒童感染性心內膜炎（Infective endocarditis）臨床表徵的敘述，下列何者錯誤？
A. 病童可能是先天性心臟病的患者，或是有放置中央靜脈導管（Central venous catheter）的患者
B. 病童有呼吸喘，夜間盜	，體重下降的症狀
C. 病童身體檢查有脾臟腫大，或是出現Roth spots等栓塞性現象（Embolic phenomena）
D. 病童的實	室檢查常有白血球低下（Leukopenia）或蛋白尿（Proteinuria）現象

正確答案：D. 病童的實	室檢查常有白血球低下（Leukopenia）或蛋白尿（Proteinuria）現象